下列那一種病毒不是藉由呼吸道傳播？
A. 鼻病毒（Rhinovirus）
B. 冠狀病毒（Coronavirus）
C. 水痘帶狀疤疹病毒（Varicella-zoster virus）
D. C 型肝炎病毒（Hepatitis C virus）

正確答案：D. C 型肝炎病毒（Hepatitis C virus）